The ascertained lead impedance is between 200 and 1500 Ohm.

The above is a clinical trial inclusion criterion. Annotated with entity spans:
The [Measurement: ascertained lead impedance] is [Value: between 200 and 1500 Ohm].